Clinical trial exclusion criterion:
patients who have drugs contraindications

Entity relations:
- AND("contraindications", "drugs")